有關嬰兒搖晃症（shaken baby syndrome）之敘述，下列何者錯誤？
A. 常跟虐兒（child abuse）有關，有時需要社工介入
B. 臨床上可做眼底檢查發現視網膜有出血現象（retinal hemorrhage）
C. 電腦斷層掃描可見急性硬膜下血腫（acute subdural hematoma）
D. 外觀上很容易發現異常

正確答案：D. 外觀上很容易發現異常